依 Anderson and D'Alonzo 分類，下列那一種齒狀突骨折（odontoid fracture）最容易發生接合不全 （non-union）？
A. type I
B. type II
C. type III
D. type IV

正確答案：B. type II